Clinical trial exclusion criteria:
Body mass index less than 18 kg/m2 or greater than 30 kg/m2.
History of previous open-laparotomy.
Surgery with major complication, or need blood transfusion.
History of hypersensitivity or adverse reaction to local anesthetics, opioid, or any ingredient of the medications administered in this study.
Severe comorbidity.
Chronic preoperative opioid consumption.
Pregnant or breastfeeding.
Inability to use the PCA device.

Annotated entities:
- Measurement: "Body mass index"
- Value: "less than 18 kg/m2"
- Value: "greater than 30 kg/m2"
- Procedure: "open-laparotomy"
- Temporal: "previous"
- Temporal: "History"
- Condition: "major complication"
- Procedure: "Surgery"
- Mood: "need"
- Condition: "blood transfusion"
- Condition: "hypersensitivity"
- Condition: "adverse reaction"
- Drug: "local anesthetics"
- Drug: "opioid"
- Drug: "ingredient of the medications administered in this study"
- Condition: "comorbidity"
- Qualifier: "Severe"
- Qualifier: "Chronic"
- Temporal: "preoperative"
- Drug: "opioid"
- Condition: "Pregnant"
- Observation: "breastfeeding"
- Condition: "Inability"
- Procedure: "use the PCA"